Clinical trial exclusion criterion:
Patients with unstable CAD, assessed by the Cardiology team and defined as new onset angina, rest angina, rapidly increasing or crescendo angina

Entity relations:
- Subsumes("unstable CAD", "new onset angina")
- OR("new onset angina", "crescendo angina", "rest angina", "rapidly increasing angina")